下列那一種鎮靜安眠藥物不會產生具有生物活性的代謝產物？
A. flurazepam
B. diazepam
C. lorazepam
D. chlordiazepoxide

正確答案：C. lorazepam